Clinical trial exclusion criterion:
Patient has been permanently discontinued from nilotinib treatment in the parent study due to unacceptable toxicity, non-compliance to study procedures, withdrawal of consent or any other reason

Annotated entities:
- Negation: "discontinued"
- Multiplier: "permanently"
- Drug: "nilotinib"
- Procedure: "treatment"
- Condition: "unacceptable toxicity"
- Observation: "non-compliance"
- Procedure: "study procedures"
- Negation: "withdrawal"
- Observation: "consent"
- Observation: "any other reason"